Patient has previously received or is receiving an organ transplant other than a liver.

The above is a clinical trial exclusion criterion. Annotated with entity spans:
Patient has previously received or is receiving an [Procedure: organ transplant] [Negation: other than] a [Qualifier: liver].